Con respecto al dolor en la infancia señale la respuesta INCORRECTA:
1. La sensación de dolor es subjetiva y debe ser aceptada por la enfermera.
2. La respuesta al dolor es importante cuando se explora a un niño para diagnosticar su enfermedad y se puede demorar su tratamiento analgésico.
3. Los padres al conocer a sus hijos son capaces de identificar cuando el niño tiene dolor.
4. Los niños no toleran el dolor mejor que los adultos.

Respuesta correcta: 2. La respuesta al dolor es importante cuando se explora a un niño para diagnosticar su enfermedad y se puede demorar su tratamiento analgésico.